En la mitosis, la membrana nuclear se desintegra y los microtúbulos del huso se fijan a los cinetocoros en:
1. Citocinesis.
2. Prometafase.
3. Metafase.
4. Interfase.
5. Profase.

Respuesta correcta: 2. Prometafase.